What are the phenotypic features of the autosomal dominant, development disease, Noonans syndrome

Noonan syndrome is an autosomal dominant disease and is characterized by developmental problems. Symptoms have been reported for this abnormality such as short stature, unusual facial characteristics, congenital heart abnormalities, developmental complications, and an elevated tumor incidence rate